對於急性氣喘發作，下列何者藥物不是第一線的治療選項？
A. β-2 Adrenergic agents
B. Anticholinergics
C. Corticosteroids
D. Theophylline

正確答案：D. Theophylline